Clinical trial exclusion criterion:
6. Newly diagnosed with PAH and not on PAH-specific therapy.

Entity relations:
- Has_temporal("PAH", "Newly diagnosed")
- OR("not", "PAH-specific therapy")